Clinical trial inclusion criterion:
Patients must have adequate renal function as documented by a calculated creatinine clearance ≥ 60.

Entity relations:
- Has_value("renal function", "adequate")
- Has_value("calculated creatinine clearance", "≥ 60")
- AND("renal function", "calculated creatinine clearance")